Clinical trial inclusion criterion:
Current diagnosis of bipolar disorder or schizophrenia on structured interview (MINI Plus)

Entity relations:
- Subsumes("structured interview", "MINI Plus")
- AND("structured interview", "bipolar disorder")
- OR("bipolar disorder", "schizophrenia")